Clinical trial exclusion criterion:
Treatments or procedures indicated on the tear film dysfunction treatment, as punctal silicone plugs.

Annotated entities:
- Procedure: "Treatments"
- Procedure: "procedures"
- Procedure: "tear film dysfunction treatment"
- Device: "punctal silicone plugs"